Clinical trial exclusion criterion:
2. Evidence of STEMI within 72 hours of the intended treatment on infarct related or non-infarct related artery.

Entity relations:
- Has_qualifier("treatment", "infarct related artery")
- Has_temporal("STEMI", "within 72 hours")
- AND("STEMI", "treatment")
- OR("infarct related artery", "non-infarct related artery")